Clinical trial exclusion criterion:
Clinically significant systemic disease (such as diabetes, metabolic syndrome, immunological diseases, diagnosed thrombophilia, porphyria, or any other medical condition requiring the use of low-molecular weight heparin therapy)

Entity relations:
- AND("medical condition", "low-molecular weight heparin")
- Has_qualifier("systemic disease", "Clinically significant")
- Subsumes("systemic disease", "diabetes")
- OR("diabetes", "diagnosed thrombophilia", "immunological diseases", "metabolic syndrome", "medical condition", "porphyria")